Clinical trial exclusion criterion:
14. History of obstructive sleep apnea.

Entity relations:
- Has_temporal("obstructive sleep apnea", "History")